Clinical trial exclusion criterion:
Permanent makeup or tattoos with metallic dyes

Annotated entities:
- Observation: "Permanent makeup"
- Observation: "tattoos"
- Device: "metallic dyes"